La reacción de 3-metilciclohex-2-enona con dibutilcuprato de litio y adición posterior de clorotrimetilsilano da:
1. [(3-Butil-3-metilciclohex-1-en-1il)oxi]trimetilsilano.
2. [(1-Butil-3-metilciclohex-2-en-1il)oxi]trimetilsilano.
3. Nada.
4. 3-Butil-3-metil-2-(trimetilsilil)ciclohexanona.
5. [(6-Butoxi-3-metilciclohex-1-en-1il)oxi]trimetilsilano.

Respuesta correcta: 1. [(3-Butil-3-metilciclohex-1-en-1il)oxi]trimetilsilano.